¿Cuál es la característica esencial de los trastornos disociativos, según el DSM-IV-TR?
1. Una alteración de las funciones integradoras de la conciencia, la identidad, la memoria y la percepción del entorno, pudiendo ser esta alteración repentina o gradual, transitoria o crónica.
2. La presencia de uno o más estados de identidad o personalidad que controlan el comportamiento del sujeto de forma recurrente con la incapacidad de recordar información personal importante.
3. La sensación persistente y recurrente de distanciamiento de los procesos mentales y del propio cuerpo con la conservación del sentido de realidad.
4. La incapacidad para recordar la información personal importante de naturaleza traumática.
5. La presencia de viajes repentinos e inesperados lejos del hogar con la incapacidad para recordar el pasado propio, confusión sobre la propia identidad y asunción de una nueva identidad.

Respuesta correcta: 1. Una alteración de las funciones integradoras de la conciencia, la identidad, la memoria y la percepción del entorno, pudiendo ser esta alteración repentina o gradual, transitoria o crónica.